Clinical trial exclusion criterion:
Chronic kidney disease with estimated Glomerular Filtration Rate < 30 ml/min/1.73 m2,

Entity relations:
- Has_value("estimated Glomerular Filtration Rate", "< 30 ml/min/1.73 m2")
- AND("Chronic kidney disease", "estimated Glomerular Filtration Rate")